Clinical trial exclusion criteria:
Earlier operations in the foot and leg, that is judged to complicate training
known arthritis.
known diabetes
Leg ulcerations or infections in the foot.
Judged unable to comply with the training protocol.
Daily use of pain killers
Glucocorticosteroid injection to the diseased achilles tendon within the last 6 months.
Earlier allergic reactions to glucocorticosteroid or local anesthetic.
Pregnancy or planning to become pregnant
BMI above 30.

Annotated entities:
- Non-query-able: "Earlier operations in the foot and leg, that is judged to complicate training"
- Condition: "arthritis"
- Condition: "diabetes"
- Condition: "Leg ulcerations"
- Condition: "infections in the foot"
- Post-eligibility: "Judged unable to comply with the training protocol."
- Drug: "pain killers"
- Multiplier: "Daily"
- Drug: "Glucocorticosteroid"
- Procedure: "injection"
- Condition: "diseased achilles tendon"
- Temporal: "within the last 6 months"
- Condition: "allergic reactions"
- Drug: "glucocorticosteroid"
- Drug: "local anesthetic"
- Temporal: "Earlier"
- Condition: "Pregnancy"
- Mood: "planning to become"
- Condition: "pregnant"
- Measurement: "BMI"
- Value: "above 30"